History of medically treated diabetes or of treated or medically diagnosed hypertension. Heterozygous subjects who have diagnosed hypertension and are well controlled on treatment (Refer to Exclusion Criteria 20 below), are eligible. .

The above is a clinical trial exclusion criterion. Annotated with entity spans:
[Temporal: History] of [Qualifier: medically treated] [Condition: diabetes] or of [Qualifier: treated] or [Drug: medically] diagnosed [Condition: hypertension]. [Condition: Heterozygous] subjects who have diagnosed [Condition: hypertension] and are [Qualifier: well controlled] on [Procedure: treatment] (Refer to Exclusion Criteria 20 below), [Grammar_Error: are eligible]. [Parsing_Error: .]